20歲男子頸部淋巴結腫大有6星期之久，到教學醫院之耳鼻喉科求診，經fiberoscopy檢查顯示頭頸部區域黏膜正常，排除頭頸部惡性腫瘤的診斷。這名患者沒有感染的跡象，理學檢查顯示firm、non-tender及rubber-like，徑長3公分大之淋巴結。下列何者為在這個階段最適當的處置？
A. 淋巴結超音波（sonography）
B. 切除性生檢（excisonal biopsy）
C. 細針穿刺（fine needle aspiration）
D. 正子掃描（PET scan）

正確答案：B. 切除性生檢（excisonal biopsy）